Clinical trial inclusion criterion:
able and willing to give written consent for participation in the study;

Annotated entities:
- Non-query-able: "able and willing to give written consent for participation in the study;"
- Post-eligibility: "able and willing to give written consent for participation in the study;"